Clinical trial exclusion criterion:
Pathological fetal heart rate pattern (cardiotocogram, CTG) before Syntocinon® initiation

Entity relations:
- Has_index("before Syntocinon® initiation", "Syntocinon® initiation")
- AND("Syntocinon® initiation", "Syntocinon®")
- AND("Pathological fetal heart rate pattern", "cardiotocogram")
- Has_temporal("Pathological fetal heart rate pattern", "before Syntocinon® initiation")
- OR("cardiotocogram", "CTG")